El patrón de apego que se observa de manera más frecuente en los niños es:
1. Apego ansioso.
2. Apego ansioso evitativo.
3. Apego ambivalente.
4. Apego seguro.
5. Desapego.

Respuesta correcta: 4. Apego seguro.